Clinical trial exclusion criteria:
pregnant or nursing woman
serious concomitant illness and malignant tumor of any kind
history of hypersensitivity to test drugs
serious bleeding during the course of the ulcer
previous gastric surgery
receiving bismuth salts, PPIs, or antibiotics in the previous month.

Annotated entities:
- Condition: "pregnant"
- Condition: "nursing"
- Person: "woman"
- Condition: "illness"
- Temporal: "concomitant"
- Qualifier: "serious"
- Condition: "malignant tumor"
- Qualifier: "any kind"
- Temporal: "history of"
- Condition: "hypersensitivity"
- Drug: "test drugs"
- Qualifier: "serious"
- Condition: "bleeding"
- Temporal: "during the course of the ulcer"
- Temporal: "previous"
- Procedure: "gastric surgery"
- Drug: "bismuth salts"
- Drug: "PPIs"
- Drug: "antibiotics"
- Temporal: "in the previous month"